Substantial alcohol use

The above is a clinical trial exclusion criterion. Annotated with entity spans:
[Condition: Substantial alcohol use]